Personal history of Guillain-Barré Syndrome.

The above is a clinical trial exclusion criterion. Annotated with entity spans:
Personal [Temporal: history] of [Condition: Guillain-Barré Syndrome].